下列何種疾病少有肺塌陷（atelectasis）情形？
A. 氣胸（pneumothorax）
B. 乳糜胸（chylothorax）
C. 新生兒呼吸窘迫症候群（neonatal respiratory distress syndrome）
D. 周邊性肺癌

正確答案：D. 周邊性肺癌